Clinical trial inclusion criterion:
If cirrhosis, Child A score with total bilirubin less than 30 micromoles per liter

Annotated entities:
- Condition: "cirrhosis"
- Measurement: "Child score"
- Value: "A"
- Measurement: "total bilirubin"
- Value: "less than 30 micromoles per liter"